腎絲球過濾率可藉由自主控制（autoregulation）在血壓變化時，仍能保持穩定之腎絲球過濾率，下列有關腎絲球過濾率自主控制之敘述，何者正確？
A. 出球小動脈（efferent arteriole）之自主控制來自肌源性（myogenic）反射
B. 腎小管腎絲球回饋（tubuloglomerular feedback），會影響出球小動脈（efferent arteriole）之收縮與舒張
C. 腎小球旁器（juxtaglomerular apparatus）釋出腎素（renin），引發入球小動脈（afferent arteriole）之收縮
D. 抑制腎小管產生腺苷（adenosine），可造成入球小動脈（afferent arteriole）之擴張

正確答案：D. 抑制腎小管產生腺苷（adenosine），可造成入球小動脈（afferent arteriole）之擴張